Clinical trial exclusion criterion:
Allergy or hypersensitivity to target medication or any of its components

Entity relations:
- AND("Allergy", "target medication")
- OR("Allergy", "hypersensitivity")